Clinical trial exclusion criterion:
Creatinine level >1.5 mg/dL or dependence on dialysis

Annotated entities:
- Measurement: "Creatinine level"
- Value: ">1.5 mg/dL"
- Procedure: "dialysis"